有關精子通過之前後路徑，下列那一項組合正確？
A. 輸精管（ductus deferens）→睪丸網（rete testis）→副睪（epidydimis）→射精管（ejaculatory duct）
B. 睪丸網（rete testis）→射精管（ejaculatory duct）→輸精管（ductus deferens）→儲精囊（seminal vesicle）
C. 輸精管（ductus deferens）→射精管（ejaculatory duct）→膀胱（bladder）→尿道（urethral）
D. 睪丸網（rete testis）→副睪（epidydimis）→輸精管（ductus deferens）→射精管（ejaculatory duct）

正確答案：D. 睪丸網（rete testis）→副睪（epidydimis）→輸精管（ductus deferens）→射精管（ejaculatory duct）